Clinical trial inclusion criterion:
Age of at least 10 hours

Entity relations:
- Has_value("Age", "at least 10 hours")